吸收性高鈣尿症（absorptive hypercalciuria）中 Type I 和食物無關時，其治療方法是：
A. 投與 cellulose phosphate
B. 投與 allopurinol
C. 投與 orthophosphate
D. 投與 Vit. D

正確答案：A. 投與 cellulose phosphate